由菊花花粉中分離出一種蛋白質，可被 50%以上菊花過敏病人血清中的 IgE 抗體所辨識，此蛋白質最可能的特性為何？
A. 分子量大於 150KD
B. 水溶性差
C. 具蛋白水解酵素（protease）功能
D. 容易刺激 T 細胞產生 IFN-γ

正確答案：C. 具蛋白水解酵素（protease）功能